Clinical trial exclusion criterion:
Patients will not be included if they have reached a stable dose of warfarin, liver dysfunction, alcoholism, use of another anticoagulant, use of chemotherapy, or if they do not meet the inclusion criteria

Annotated entities:
- Multiplier: "stable dose"
- Drug: "warfarin"
- Condition: "liver dysfunction"
- Condition: "alcoholism"
- Qualifier: "another"
- Drug: "anticoagulant"
- Procedure: "chemotherapy"
- Post-eligibility: "if they do not meet the inclusion criteria"